Según la Teoría de las Inteligencias Múltiples, la inteligencia intrapersonal:
1. Ha sido preponderante en nuestro sistema actual de evaluación académica.
2. Es la capacidad para entender e interactuar con los demás.
3. Se centra en el potencial para formarse un modelo mental de un mundo espacial.
4. Es la capacidad para formase un modelo ajustado de uno mismo y de usarlo eficazmente en la vida.
5. Se exhibe a la hora de elaborar productos que necesitan emplear el cuerpo.

Respuesta correcta: 4. Es la capacidad para formase un modelo ajustado de uno mismo y de usarlo eficazmente en la vida.